一位 3 個月大的男嬰自出生後便有成長遲緩現象，理學檢查發現有肌無力徵候。血液檢查發現乳酸 （lactate）、丙酮酸（pyruvate）、丙胺酸（alanine）上升，並有代謝性酸中毒（metabolic acidosis）
 現象。根據這些病徵，可優先考慮以何種維生素作為治療？
A. 維生素 B6（pyridoxine）
B. 菸鹼酸（niacin）
C. 核黃素（riboflavin）
D. 硫胺（thiamine）

正確答案：D. 硫胺（thiamine）